Clinical trial exclusion criterion:
Liver biopsy at any time showing mHAI stage 4 or higher fibrosis OR

Entity relations:
- Has_value("mHAI stage", "4 or higher")
- AND("Liver biopsy", "mHAI stage")
- Has_temporal("Liver biopsy", "any time")